La GnRH (ganodorelina) es un decapéptido hipotalámico que se secreta de forma pulsátil. Últimamente se han desarrollado una serie de análogos que:
1. Todos ellos inhiben de forma prolongada la secreción de LH y FSH.
2. Todos ellos son agonistas del receptor a GnRH.
3. La goserelina y buserelina son antagonistas del receptor GnRH.
4. El tratamiento prolongado da lugar a una sintomatología típica de un exceso de esteroides gonadales.
5. Los agonistas GnRH están contraindicados en el cáncer de próstata y mama.

Respuesta correcta: 1. Todos ellos inhiben de forma prolongada la secreción de LH y FSH.